Clinical trial exclusion criterion:
Subjects with known hypersensitivity to tranexamic acid

Annotated entities:
- Condition: "hypersensitivity"
- Drug: "tranexamic acid"